Clinical trial inclusion criterion:
Met MGH transplant center criteria, listed for liver transplant

Annotated entities:
- Qualifier: "MGH transplant center criteria"
- Procedure: "liver transplant"